Given Ante-natal Cards of the Ghana Health Service

The above is a clinical trial inclusion criterion. Annotated with entity spans:
[Non-representable: Given Ante-natal Cards of the Ghana Health Service]